Clinical trial inclusion criterion:
Newly diagnosed patients with previous excisional biopsy. OR

Annotated entities:
- Procedure: "excisional biopsy"
- Temporal: "previous"